History of significant psychiatric conditions that may affect patient assessment

The above is a clinical trial exclusion criterion. Annotated with entity spans:
[Non-query-able: History of significant psychiatric conditions that may affect patient assessment]